Clinical trial exclusion criterion:
prior allergic reaction to interferon products, congestive heart failure, elevated liver enzymes

Entity relations:
- AND("allergic reaction", "interferon products")
- Has_temporal("allergic reaction", "prior")
- OR("allergic reaction", "elevated liver enzymes", "congestive heart failure")